Clinical trial inclusion criterion:
Presence of intracranial aneurysm (with or without rupture)

Annotated entities:
- Condition: "intracranial aneurysm"
- Qualifier: "without rupture"
- Qualifier: "with rupture"